Clinical trial inclusion criterion:
Age 18 to 45 years Irregular menstruation (> 35 days) or secondary amenorrhea> 3 months

Annotated entities:
- Person: "Age"
- Value: "18 to 45 years"
- Condition: "Irregular menstruation"
- Line: "Age 18 to 45 years"
- Line: "Irregular menstruation (> 35 days) or secondary amenorrhea> 3 months"
- Value: "> 35 days"
- Condition: "secondary amenorrhea"
- Temporal: "> 3 months"